Clinical trial exclusion criterion:
Uncontrolled or active depression or other psychiatric disorder that in the opinion of the site investigator might preclude adherence to study requirements or impact NC functioning and assessments.

Annotated entities:
- Temporal: "active"
- Qualifier: "Uncontrolled"
- Condition: "depression"
- Condition: "psychiatric disorder"
- Qualifier: "other"